Clinical trial inclusion criterion:
Score ≤ 10 on the Short Physical Performance Battery OR Walking speed < 1.2 m/sec during 400 m usual-paced test

Entity relations:
- Has_value("Short Physical Performance Battery", "Score ≤ 10")
- Has_value("Walking speed", "< 1.2 m/sec")
- AND("Walking speed", "400 m usual-paced test")
- OR("Short Physical Performance Battery", "Walking speed")